Body Mass Index (BMI) > 32

The above is a clinical trial exclusion criterion. Annotated with entity spans:
[Measurement: Body Mass Index (BMI)] [Value: > 32]